下列何藥物對鎮靜劑midazolam具有拮抗作用，會競爭中樞神經系統的受體，以舒緩過量midazolam所造成的呼吸影響？
A. flumazenil
B. dexmedetomidine
C. ketamine
D. naloxone

正確答案：A. flumazenil